Clinical trial inclusion criterion:
an intention of H. pylori eradication treatment and have written inform consent

Annotated entities:
- Informed_consent: "an intention of H. pylori eradication treatment and have written inform consent"